Patients with active infections requiring antibiotics within one month of registration

The above is a clinical trial exclusion criterion. Annotated with entity spans:
Patients with [Temporal: active] [Condition: infections] requiring [Drug: antibiotics] [Temporal: within one month of registration]